Clinical trial inclusion criterion:
7. Adequate liver function as follows (10% deviation allowed)

Annotated entities:
- Parsing_Error: "7."
- Measurement: "liver function"
- Value: "Adequate"
- Parsing_Error: "Adequate liver function as follows (10% deviation allowed)"